Clinical trial exclusion criterion:
Placenda previa and/or accreta

Annotated entities:
- Condition: "Placenda previa"
- Condition: "accreta"